腫瘤缺氧時，缺氧性誘導轉錄因子（hypoxia inducible transcription factor-1, HIF-1）會被活化，下列相關敘述何者錯誤？
A. HIF-1的活性可以被延胡索酸（fumarate）誘發
B. HIF-1可以刺激糖解反應（glycolysis），讓腫瘤細胞可以在缺氧環境下存活
C. HIF-1也會增加血管內皮細胞生長素（vascular endothelial growth factor, VEGF）表達，促進腫瘤血管新生
D. HIF-1活化不會減少活性氧化物（reactive oxygen species, ROS）的形成

正確答案：D. HIF-1活化不會減少活性氧化物（reactive oxygen species, ROS）的形成